Clinical trial inclusion criterion:
Diagnosis of sacroiliitis

Annotated entities:
- Condition: "sacroiliitis"